En relación a los cambios sensoriales que se producen en la visión durante el envejecimiento, es correcto que:
1. El campo visual no se modifica.
2. La pupila es más sensible a la luz, favoreciendo el deslumbramiento.
3. La percepción de la profundidad se distorsiona.
4. El umbral para la percepción de la luz disminuye.
5. Hay una pérdida uniforme de la percepción de todos los colores.

Respuesta correcta: 3. La percepción de la profundidad se distorsiona.